下列那一種藥物不能和 sildenafil（商品名 Viagra）藥物併用？
A. Nitroglycerine
B. Apresoline
C. Digoxin
D. Aspirin

正確答案：A. Nitroglycerine